精索靜脈曲張（varicocele）的現象：
A. 好發於左側
B. 好發於右側
C. 發生率兩側差不多
D. 很少發生

正確答案：A. 好發於左側